Mechanical ventilation

The above is a clinical trial inclusion criterion. Annotated with entity spans:
[Procedure: Mechanical ventilation]